假設你收集100位肺癌病人及1000位年齡、性別及社會經濟狀況相似的非肺癌控制群為研究對象，100位肺癌 病人有90位是有規律的吸菸者，1000位控制群有270位是規律的吸菸者，則吸菸得到肺癌的危險勝算比
 （odds ratio）是多少？
A. 4.1
B. 24.33
C. 300.0
D. 3.33

正確答案：B. 24.33